Food allergies (other than controlled Coeliac Disease)

The above is a clinical trial exclusion criterion. Annotated with entity spans:
[Condition: Food allergies] ([Negation: other] than controlled [Condition: Coeliac Disease])